La terapia cognitivo-conductual dialéctica, en el trastorno límite de la personalidad, ha obtenido buenos resultados en la mejoría de:
1. Las relaciones interpersonales inestables.
2. Las conductas autolíticas y de suicidio.
3. Los episodios de ira.
4. La alteración de la identidad.

Respuesta correcta: 2. Las conductas autolíticas y de suicidio.